下列何者不是造成味覺異常的常見原因？
A. drug
B. radiation therapy
C. diabetes mellitus
D. heart failure

正確答案：D. heart failure